Clinical trial inclusion criterion:
3. Male or female with a diagnosis of PBC, by at least two of the following criteria:

Annotated entities:
- Parsing_Error: "3."
- Person: "Male"
- Person: "female"
- Condition: "PBC"
- Multiplier: "at least two"
- Parsing_Error: "following criteria"
- Measurement: "following criteria"